parental permission and/or teen consent/assent as appropriate

The above is a clinical trial inclusion criterion. Annotated with entity spans:
[Informed_consent: parental permission and/or teen consent/assent as appropriate]